Is there any genetic determinant of hair pigmentation that could be useful in forensic analyses?

Yes, there are at least 12 genes associated with human hair color variation such as: TYR, TYRP1, OCA2, SLC45A2, SLC24A5, MC1R, ASIP and KITLG.